Clinical trial exclusion criterion:
With severe systemic alteration;

Entity relations:
- Has_qualifier("systemic alteration", "severe")